Clinical trial exclusion criterion:
Age under 18 years old or greater than 75 years old

Annotated entities:
- Person: "Age"
- Value: "under 18 years old or greater than 75 years old"